Clinical trial exclusion criterion:
Patients who have been previously treated with radioactive directed therapies

Annotated entities:
- Procedure: "radioactive directed therapies"
- Temporal: "previously"